Clinical trial exclusion criterion:
Intracardiac mass, tumor, or thrombus

Annotated entities:
- Condition: "Intracardiac mass"
- Condition: "tumor"
- Condition: "thrombus"